Clinical trial inclusion criterion:
No gingivitis (Community Periodontal Index score = 0).

Annotated entities:
- Negation: "No"
- Condition: "gingivitis"
- Measurement: "Community Periodontal Index score"
- Value: "= 0"